Uncontrolled or active depression or other psychiatric disorder that in the opinion of the site investigator might preclude adherence to study requirements or impact NC functioning and assessments.

The above is a clinical trial exclusion criterion. Annotated with entity spans:
[Qualifier: Uncontrolled] or [Temporal: active] [Condition: depression] or [Qualifier: other] [Condition: psychiatric disorder] that in the opinion of the site investigator might preclude adherence to study requirements or impact NC functioning and assessments.